Clinical trial inclusion criterion:
Patients presenting for CMR with the clinical diagnosis of idiopathic dilated cardiomyopathy based upon left ventricular ejection fraction =40%, LV end-diastolic diameter =55 mm or left ventricular end-systolic diameter =45 mm, and the absence of coronary stenoses on angiography.

Annotated entities:
- Condition: "idiopathic dilated cardiomyopathy"
- Measurement: "left ventricular ejection fraction"
- Value: "=40%"
- Measurement: "LV end-diastolic diameter"
- Value: "=55 mm"
- Measurement: "left ventricular end-systolic diameter"
- Value: "=45 mm"
- Negation: "absence"
- Condition: "coronary stenoses"
- Procedure: "angiography"